Clinical trial inclusion criterion:
 Second group : healthy volunteers

Annotated entities:
- Observation: "healthy"